Clinical trial exclusion criterion:
Severe bradycardia or greater than 1st degree heart block

Entity relations:
- Has_qualifier("bradycardia", "Severe")
- Has_qualifier("heart block", "greater than 1st degree")
- OR("bradycardia", "heart block")